Clinical trial exclusion criterion:
Individuals with clinical signs of parafunctional habits;

Annotated entities:
- Condition: "clinical signs of parafunctional habits"